Airway or thoracic malformation

The above is a clinical trial exclusion criterion. Annotated with entity spans:
[Condition: Airway] or [Condition: thoracic malformation]